60 歲患者 10 多年來反覆性腎結石接受多次體外震波碎石術，最近一個月因為容易疲倦，關節及骨頭疼痛接受一系列健康檢查，發現肝臟右葉有一顆 3 公分腫瘤，兩側腎結石，血清尿酸值 8.0 mg/dL；鈣值 12 mg/dL。則下列何項檢查不適於做為鑑別診斷？
A. 胎兒蛋白（α-fetoprotein）
B. 副甲狀賀爾蒙（intact PTH）
C. 甲狀腺蛋白（thyroglobulin）
D. 宜收集 24 小時尿液檢查尿鈣值

正確答案：C. 甲狀腺蛋白（thyroglobulin）